Clinical trial inclusion criterion:
Normal neurologic exam and normal mental status

Annotated entities:
- Procedure: "neurologic exam"
- Value: "Normal"
- Value: "normal"
- Measurement: "mental status"